Clinical trial exclusion criterion:
A history of severe bleeding or bleeding disorders

Entity relations:
- Has_qualifier("bleeding", "severe")
- Has_temporal("bleeding", "history")
- Has_temporal("bleeding disorders", "history")